What methodology does the HercepTest use?

The HercepTest is immunohistochemistry based.